Clinical trial exclusion criterion:
Lack of consent

Annotated entities:
- Post-eligibility: "Lack of consent"